Clinical evidence of a severe Personality Disorder, as assessed by the study psychiatrist, which would impede participation or completion of the trial.

The above is a clinical trial exclusion criterion. Annotated with entity spans:
Clinical evidence of a [Qualifier: severe] [Condition: Personality Disorder], as assessed by the study psychiatrist, which would impede participation or completion of the trial.